What is the function of a protein degron?

A protein degron is a protein that is attached to the N-terminus of a protein of interest. The N-degron then targets itself and the attached protein for rapid proteasomal degradation through a N-end rule pathway.